Clinical trial exclusion criterion:
A diagnosis of cancer (other than superficial squamous or basal cell skin cancer) in the past 3 years or current treatment for the active cancer.

Entity relations:
- Has_negation("superficial squamous skin cancer", "other than")
- Has_qualifier("cancer", "active")
- AND("treatment", "cancer")
- Has_temporal("cancer", "in the past 3 years")
- OR("superficial squamous skin cancer", "basal cell skin cancer")
- OR("cancer", "treatment")